Clinical trial inclusion criterion:
The breast tumor's positive ER/PR rate is <1%, and positive ER-beta1 rate is =10% by IHC.

Entity relations:
- Has_value("positive ER/PR rate", "<1%")
- Has_value("positive ER-beta1 rate", "=10%")
- AND("breast tumor", "positive ER/PR rate")
- AND("positive ER/PR rate", "IHC")
- AND("breast tumor", "positive ER-beta1 rate")
- AND("positive ER-beta1 rate", "IHC")